Person is willing to comply with study procedures.

The above is a clinical trial inclusion criterion. Annotated with entity spans:
[Post-eligibility: Person is willing to comply with study procedures].